關於高泌乳激素血症（hyperprolactinemia）與泌乳激素腺瘤（prolactin adenoma）之敘述，下列何者錯誤？
A. bromocriptine是短效的dopamine-like藥物，須每日服用
B. cabergoline是長效的dopamine-like藥物，每週服用2次
C. 服用bromocriptine與cabergoline，無法有效地縮小腫瘤
D. 服用bromocriptine與cabergoline，若泌乳激素（prolactin）的血中濃度降至正常範圍內達2年以上，可考慮停藥追蹤

正確答案：C. 服用bromocriptine與cabergoline，無法有效地縮小腫瘤